6. Other diseases or conditions, for which the doctor of the patients do not agree his or her participating.

The above is a clinical trial exclusion criterion. Annotated with entity spans:
6. [Non-query-able: Other diseases or conditions, for which the doctor of the patients do not agree his or her participating.]